下列何者的力量不足，最可能造成咳嗽時漏尿之現象？
A. 梨狀肌
B. 臀大肌
C. 提肛肌
D. 閉孔內肌

正確答案：C. 提肛肌